amide and/or esther local anaesthetic allergy

The above is a clinical trial exclusion criterion. Annotated with entity spans:
[Drug: amide] and/or [Drug: esther local anaesthetic] [Condition: allergy]